Patients who are unable to give informed consent

The above is a clinical trial exclusion criterion. Annotated with entity spans:
Patients who are [Observation: unable to give informed consent]